La Sra. H. H. de 69 años se queja de que no duerme bien. Respecto al sueño en los mayores se ha comprobado que:
1. El abordaje no farmacológico del insomnio ha resultado ser ineficaz en esta población.
2. El proceso de envejecimiento es una de las principales causas del insomnio.
3. Tienen sueño de peor calidad, más fragmentado y con despertares precoces.
4. Para el tratamiento del insomnio, las benzodiacepinas de vida media larga son las de menor efecto secundario.
5. Todos los hipnóticos tienen los mismos efectos secundarios en los mayores.

Respuesta correcta: 3. Tienen sueño de peor calidad, más fragmentado y con despertares precoces.